關於顱骨（cranium）發育的敘述，何項錯誤？
A. 起源於腦組織周圍之間質組織
B. 部分神經顱（neurocranium）由多塊軟骨癒合形成
C. 臟顱（viscerocranium）是大腦的主要保護結構
D. 第一、二對咽弓（pharyngeal arch）參與軟骨性臟顱（cartilaginous viscerocranium）的形成

正確答案：C. 臟顱（viscerocranium）是大腦的主要保護結構